一位健康好動的 20 歲機車騎士，不幸車禍受傷，引起左側股骨骨折，即住院治療。隔天病人呼吸速度加快，神智不清，PaO2為 55 mmHg，體溫 38℃，皮膚出現斑點狀出血，他最可能的診斷是：
A. 脂肪栓塞症候群（Fat embolism syndrome）
B. 腔室症候群（Compartment syndrome）
C. 無法認定的頭受傷（Unrecognized head trauma）
D. 肺炎

正確答案：A. 脂肪栓塞症候群（Fat embolism syndrome）